Parkinson's or other neurological disease

The above is a clinical trial exclusion criterion. Annotated with entity spans:
[Condition: Parkinson's] or other [Condition: neurological disease]